Allergies to propofol

The above is a clinical trial exclusion criterion. Annotated with entity spans:
[Condition: Allergies] to [Drug: propofol]